職業疾病的生物偵測中，姊妹染色體互換（sister chromatid exchanges）、染色體變異（chromosomal aberrations）、p53 基因突變等，是什麼疾病的生物指標？
A. 癌症
B. 心血管疾病
C. 神經疾病
D. 肝臟疾病

正確答案：A. 癌症